Diagnosis of sleep disordered breathing or obstructive sleep apnea

The above is a clinical trial inclusion criterion. Annotated with entity spans:
Diagnosis of [Condition: sleep disordered breathing] or [Condition: obstructive sleep apnea]